下列何種藥物可能有腎上腺功能的抑制作用，面對腎上腺功能障礙的病人，應特別小心使用？
A. thiopental
B. etomidate
C. dexmedetomidine
D. ketamine

正確答案：B. etomidate